Un niño de 7 años presenta un cuadro subagudo de ataxia cerebelosa e hipertensión endocraneal. La resonancia magnética demuestra una lesión expansiva en el vérmix cerebeloso que capta contraste y obstruye el cuarto ventrículo. El diagnóstico más probable es:
1. Meningioma.
2. Metástasis cerebelosa.
3. Glioblastoma multiforme.
4. Meduloblastoma.
5. Linfoma.

Respuesta correcta: 4. Meduloblastoma.